Severely elevated serum BNP defined as BNP>300pg/ml

The above is a clinical trial exclusion criterion. Annotated with entity spans:
[Value: Severely elevated] [Measurement: serum BNP] defined as [Measurement: BNP][Value: >300pg/ml]